Which company produces ORMD-0801?

ORMD-0801 is produced by Oramed Pharmaceuticals.